下列有關陰囊 dartos fascia 的描述，何者正確？
A. 與腹部的 Camper's fascia 相連
B. 含豐富的皮下脂肪
C. 含骨骼肌構成的 dartos muscle
D. 含提睪肌（cremasteric muscle）

正確答案：A. 與腹部的 Camper's fascia 相連